4. de novo native vessels;

The above is a clinical trial inclusion criterion. Annotated with entity spans:
4. [Qualifier: de novo] [Condition: native vessels];